二十歲年輕女性病人，主訴容易皮下瘀血（purpura）、流鼻血（epistaxis）及齒齦出血（gingival bleeding） ，經抽血檢查，呈現血小板低下（thrombocytopenia），骨髓檢查正常。此病人最可能的診斷為何？
A. 全身性紅斑性狼瘡（systemic lupus erythematosus）
B. 原發性血小板減少紫斑症（idiopathic thrombocytopenic purpura）
C. 先天性血小板減少症（congenital thrombocytopenia）
D. 脾機能亢進（hypersplenism）

正確答案：B. 原發性血小板減少紫斑症（idiopathic thrombocytopenic purpura）